fibrolamellar hepatocellular carcinoma（FHCC）是一種變異型的肝細胞癌，和傳統的肝細胞癌比較起來，有關 FHCC的敘述，何者正確?
A. 男性較女性常見
B. 發生的年紀較大
C. 易合併有肝硬化
D. 侵犯性較小

正確答案：D. 侵犯性較小